10. Chronic infections including, but not limited to tuberculosis (TB), hepatitis B virus (HBV) or hepatitis C virus (HCV).

The above is a clinical trial exclusion criterion. Annotated with entity spans:
[Parsing_Error: 10.] [Multiplier: Chronic] [Condition: infections] including, but not limited to [Condition: tuberculosis (TB)], [Condition: hepatitis B virus (HBV)] or [Condition: hepatitis C virus (HCV)].